Which enzyme is deficient in Wolman disease?

Deficiency of lysosomal acid lipase (LAL) causes Wolman disease.